La reacción del benceno con el cloruro de tercbutilo, en presencia de tricloruro de aluminio es un ejemplo de:
1. Reacción de sustitución aromática nucleofílica.
2. Sustitución aromática electrofílica.
3. Adición de halógenos.
4. Hidrólisis catalizada por ácidos.
5. Obtención de halogenuros de alquilo.

Respuesta correcta: 2. Sustitución aromática electrofílica.